Según Berman et al., desde el punto de vista sanitario, al grupo social básico constituido por personas de género femenino o masculino, jóvenes o adultos, unidos por lazos legales, de amistad, relacionados o no genéticamente y que los demás consideran allegados, se le denomina:
1. Colectivo.
2. Sistema informal.
3. Grupo control.
4. Ciudadanía.
5. Familia.

Respuesta correcta: 5. Familia.